Clinical trial inclusion criterion:
Have a good clinical response to TB.

Entity relations:
- AND("good clinical response", "TB")